一位下肢骨折的病患經治療後恢復行走，但治療期間因臥床造成褥瘡而來求診，則下列處置何者較不適當？
A. 適當良好的傷口照護
B. 良好的營養支持
C. 進行高壓氧治療
D. 避免褥瘡處受壓

正確答案：C. 進行高壓氧治療